下列何者最不適用於預測腦傷（traumatic brain injury）病人的預後？
A. 病發時意識不清的時間長短
B. 受傷後健忘症（amnesia）的時間長短
C. 受傷時的格拉斯可（Glasgow）昏迷指數
D. 眨眼反射（blink reflex）

正確答案：D. 眨眼反射（blink reflex）